Clinical trial exclusion criterion:
inability to understand trial Information

Annotated entities:
- Post-eligibility: "inability to understand trial Information"